Clinical trial exclusion criterion:
Trauma or extensive surgery within 1 month before randomization or surgery planned in the next 6 months after randomization.

Annotated entities:
- Condition: "Trauma"
- Procedure: "extensive surgery"
- Temporal: "within 1 month before randomization"
- Procedure: "surgery"
- Mood: "planned"
- Temporal: "in the next 6 months after randomization"